胃部最常見的原發性癌症的組織型是：
A. 腺癌（adenocarcinoma）
B. 鱗狀細胞癌（squamous cell carcinoma）
C. 淋巴瘤（lymphoma）
D. 平滑肌肉瘤（leiomyosarcoma）

正確答案：A. 腺癌（adenocarcinoma）